Clinical trial inclusion criterion:
8. Upon pelvic/speculum examination and colposcopy at the time of enrollment, the cervix and vagina appear normal as determined by the investigator

Entity relations:
- Has_temporal("pelvic examination", "at the time of enrollment")
- Has_qualifier("vagina", "normal")
- Has_qualifier("cervix", "normal")
- Has_context("pelvic examination", "vagina")
- OR("pelvic examination", "speculum examination", "colposcopy")